En ciertos casos es necesario llevar a cabo tratamientos previos con agentes oxidantes o reductores en valoraciones redox con la finalidad de:
1. Transformar el analito a un estado de oxidación adecuado para su posterior valoración.
2. Asegurar que todo el analito se encuentra en disolución.
3. Preparar la disolución de indicador para que vire correctamente en el punto final.
4. Conseguir que la reacción entre valorador y analito sea completa.
5. Mejorar la precisión de la valoración.

Respuesta correcta: 1. Transformar el analito a un estado de oxidación adecuado para su posterior valoración.